下列何種人類病毒最適合生長於攝氏33-35度，所以通常感染上呼吸道。不過，動物來源的此類病毒卻能生長在攝氏37度，因此能造成全身性感染？
A. 間質肺炎病毒（Metapneumovirus）
B. 腺病毒（Adenovirus）
C. 呼吸道細胞融合病毒（Respiratory syncytial virus）
D. 冠狀病毒（Coronavirus）

正確答案：D. 冠狀病毒（Coronavirus）